What alternate indication has Vanoxerine been repositioned for?

vanoxerine's effects were strongly frequency-dependent and we repositioned it for treatment of atrial fibrillation and flutter.